Clinical trial exclusion criterion:
Patients with head trauma or Neurosurgical intervention

Entity relations:
- OR("head trauma", "Neurosurgical intervention")